Very excessive daytime sleepiness (Epworth Sleepiness Scale> 18).

The above is a clinical trial exclusion criterion. Annotated with entity spans:
[Qualifier: Very excessive] [Condition: daytime sleepiness] ([Measurement: Epworth Sleepiness Scale][Value: > 18]).